Clinical trial exclusion criterion:
history of > 1 urogenital infection/year

Annotated entities:
- Condition: "urogenital infection"
- Multiplier: "> 1 /year"